previous retinal vein occlusion.

The above is a clinical trial exclusion criterion. Annotated with entity spans:
[Temporal: previous] [Condition: retinal vein occlusion].